一位 8 歲的男孩，罹患氣喘病，醫師建議要規則用藥治療，下列何藥物不可單獨使用於慢性氣喘病人的長期治療？
A. Inhaled corticosteroids
B. Inhaled long-acting β2-agonists
C. Leukotriene modifiers
D. Theophylline

正確答案：B. Inhaled long-acting β2-agonists